La estructura tridimensional del B-ADN:
1. Es más corta y ancha que la del A-ADN.
2. Posee alrededor de 20pb por cada giro de 360º de la hélice.
3. Es la estructura más estable en condiciones fisiológicas.
4. Aparece cuando el ADN es colocado en una solución salina.
5. Es una hélice levógira.

Respuesta correcta: 3. Es la estructura más estable en condiciones fisiológicas.